Clinical trial exclusion criterion:
Evidence of current uncontrolled cardiovascular conditions, including uncontrolled hypertension, uncontrolled cardiac arrhythmias, symptomatic congestive heart failure, unstable angina, or myocardial infarction within the past 6 months.

Annotated entities:
- Condition: "cardiovascular conditions"
- Qualifier: "uncontrolled"
- Condition: "hypertension"
- Qualifier: "uncontrolled"
- Condition: "cardiac arrhythmias"
- Qualifier: "symptomatic"
- Condition: "congestive heart failure"
- Condition: "unstable angina"
- Condition: "myocardial infarction"
- Temporal: "within the past 6 months"
- Qualifier: "uncontrolled"
- Temporal: "current"